Clinical trial inclusion criterion:
parturient in labour without cervical dilation and regular uterine contractions

Annotated entities:
- Procedure: "labour"
- Person: "parturient"
- Negation: "without"
- Procedure: "cervical dilation"
- Condition: "regular uterine contractions"